Clinical trial inclusion criterion:
Children 2-5 years with negative TSTs who have been in close contact with a case of active TB disease recently

Annotated entities:
- Person: "Children"
- Person: "years"
- Value: "2-5"
- Measurement: "TSTs"
- Value: "negative"
- Non-query-able: "who have been in close contact with a case of active TB disease recently"